Clinical trial inclusion criterion:
Atrial fibrillation on sub-optimal OAC

Annotated entities:
- Condition: "Atrial fibrillation"
- Procedure: "OAC"
- Qualifier: "sub-optimal"